¿Cuál de los siguientes tratamientos conductuales es el adecuado para el abordaje del Trastorno por tics en la infancia?:
1. Entrenamiento en relajación.
2. Inversión del hábito.
3. Práctica masiva positiva.
4. Manejo de contingencias.

Respuesta correcta: 2. Inversión del hábito.